關於頸椎椎間盤突出症之敘述，下列何者正確？
A. 頸椎椎間盤突出症之疼痛不會傳至前胸
B. 中間型（central）之椎間盤突出症較易導致脊髓的壓迫
C. 第五、六頸椎間之外側型（lateral）椎間盤突出症較易壓迫到C5神經根
D. 若懷疑神經根壓迫應儘速（一週內）安排肌電圖檢查

正確答案：B. 中間型（central）之椎間盤突出症較易導致脊髓的壓迫